Fasting blood glucose >126 mg/dL at screening. Heterozygous subjects will be excluded for a fasting blood glucose >140 mg/dL.

The above is a clinical trial exclusion criterion. Annotated with entity spans:
[Measurement: Fasting blood glucose] [Value: >126 mg/dL] [Temporal: at screening]. [Condition: Heterozygous] subjects will be excluded for a [Measurement: fasting blood glucose] [Value: >140 mg/dL].